Plan to remove the tumor surgically before completing the protocol chemo/radiotherapy course

The above is a clinical trial exclusion criterion. Annotated with entity spans:
[Mood: Plan to remove the tumor surgically] [Temporal: before completing the protocol chemo/radiotherapy course]